known impaired renal function

The above is a clinical trial exclusion criterion. Annotated with entity spans:
known [Condition: impaired renal function]